Clinical trial exclusion criterion:
Patients with history of significant cardiac disease

Annotated entities:
- Temporal: "history"
- Qualifier: "significant"
- Condition: "cardiac disease"